Between the ages of 21-60

The above is a clinical trial inclusion criterion. Annotated with entity spans:
[Value: Between] the [Person: ages] of 21-60